Clinical trial exclusion criterion:
alergy to fish, protamine, protamine derivates, history of Humulin N, Novolin N, Novolin NPH, Gensulin N, SciLin N, NPH Iletin II and isophane insulin intake

Entity relations:
- Has_temporal("Humulin N", "history")
- AND("alergy", "fish")
- OR("Humulin N", "isophane insulin", "SciLin N", "Gensulin N", "Novolin NPH", "Novolin N", "NPH Iletin II")
- OR("fish", "protamine", "protamine derivates")
- OR("alergy", "history")